一對剛歸國定居的中年夫婦，近半年來逐漸出現皮膚色素沈澱、腸胃不適、肝腎功能異常、全身感覺及運動功能障礙、禿頭、呼氣有大蒜味道，他們可能之前被下列何種毒素汙染？
A. 汞（mercury）
B. 鉛（lead）
C. 砷（arsenic）
D. 錳（manganese）

正確答案：C. 砷（arsenic）